El tratamiento antibiótico recomendado en una diarrea aguda por Clostridium difficile es:
1. Administrar vancomicina por vía oral.
2. Administrar vancomicina por vía intravenosa.
3. Administrar ciprofloxacino por vía oral.
4. Administrar metronidazol por vía oral.
5. Administrar rifaximina por vía oral.

Respuesta correcta: 4. Administrar metronidazol por vía oral.